Clinical trial inclusion criterion:
Metastatic breast cancer (BR)

Annotated entities:
- Condition: "Metastatic breast cancer"